Clinical trial exclusion criterion:
Allergy against to penicillin or cephalosporins

Entity relations:
- AND("Allergy", "penicillin")
- OR("penicillin", "cephalosporins")